32 歲男性，靜脈注射藥癮患者。近一週來覺得噁心、嘔吐及尿液顏色變深。實驗室檢查發現膽紅素、結合型膽紅素值、AST 及 ALT 值明顯上升。肝炎病毒檢測結果如下：HBsAg 陽性，Anti-HBs 陰性， Anti-HBc陽性，IgM-anti-HBc陰性，IgG-anti-HAV陽性，IgM-anti-HAV陰性，Anti-HCV陰性，Anti-HDV 陽性。最可能的診斷為何？
A. 急性 A 型肝炎病毒感染
B. 急性 B 型肝炎病毒感染
C. 慢性 C 型肝炎病毒感染
D. 慢性 B 型肝炎病毒感染併急性 D 型肝炎病毒感染

正確答案：D. 慢性 B 型肝炎病毒感染併急性 D 型肝炎病毒感染